Presenting with hernia requiring surgical intervention

The above is a clinical trial inclusion criterion. Annotated with entity spans:
Presenting with [Condition: hernia] [Mood: requiring] [Procedure: surgical intervention]